Clinical trial exclusion criterion:
Hypersensitivity or allergic reaction to regadenoson or adenosine

Entity relations:
- AND("Hypersensitivity", "regadenoson")
- OR("Hypersensitivity", "allergic")
- OR("regadenoson", "adenosine")